Which mutation is targeted by Tepotinib?

MET Exon 14 Skipping Mutation is targeted by Tepotinib that is used for patients with non-small-cell lung cancer.